下列各項產檢的時機，何者錯誤？
A. 妊娠 16-18 週可進行羊膜穿刺
B. 妊娠 20-24 週是進行超音波胎兒篩檢最好的時機
C. 妊娠 28-32 週可進行四指標母血唐氏症篩檢
D. 妊娠 35-37 週可進行 B 群鏈球菌的培養

正確答案：C. 妊娠 28-32 週可進行四指標母血唐氏症篩檢